Clinical trial inclusion criterion:
Patient with known or suspected cirrhosis

Entity relations:
- Has_mood("cirrhosis", "known")
- OR("known", "suspected")